在某安養院，有多名老人先後出現乾咳和胸痛等急性呼吸道感染症狀，其中數名更發展成肺炎而緊急送醫治療。醫院由病人的肺組織或呼吸道分泌液等檢體以及安養院的冷卻水塔中，分離出同一種 培養時需添加半胱胺酸（L-cysteine）的革蘭氏陰性桿菌。下列有關此感染症的敘述，何者錯誤？
A. 病人由呼吸道得到感染
B. 因傳染性高，病人需隔離
C. 目前仍無疫苗可以使用
D. 細胞型免疫（cellular immunity）是人體主要的防禦機制

正確答案：B. 因傳染性高，病人需隔離